Clinical trial inclusion criterion:
Greater than or 18 years of age

Annotated entities:
- Value: "Greater than or 18 years"
- Person: "age"